Which is the main CHEK2 genetic variant, thought to be involved in familial breast cancer?

CHEK2 1100delC mutation is recurrently detected in the general population and is thought to confer a moderate risk for breast cancer.